Clinical trial exclusion criterion:
Patients who are allergic to IP or macrolide compounds.

Annotated entities:
- Condition: "allergic"
- Drug: "IP"
- Drug: "macrolide"